Anti-mullerian hormone (AMH) greater than (>) 1.1 nanogram per milliliter (ng/mL)

The above is a clinical trial inclusion criterion. Annotated with entity spans:
[Measurement: Anti-mullerian hormone (AMH)] [Value: greater than (>) 1.1 nanogram per milliliter (ng/mL)]